Clinical trial exclusion criterion:
Female patients who are lactating and breastfeeding or pregnant

Annotated entities:
- Pregnancy_considerations: "Female patients who are lactating and breastfeeding or pregnant"